List adenosine A2A receptor antagonists that are used for Parkinson's disease treatment.

Istradefylline and preladenant are adenosine A2A receptor antagonists that are used for Parkinson's disease treatment.